新生兒畸胎瘤 (teratoma) 最好發的部位在下列何處?
A. 睪丸（testis）
B. 卵巢（ovary）
C. 縱隔腔部（mediastinal region）
D. 薦尾椎部（sacrococcygeal region）

正確答案：D. 薦尾椎部（sacrococcygeal region）